Asthma

The above is a clinical trial exclusion criterion. Annotated with entity spans:
[Condition: Asthma]